Use of depo medroxyprogesterone within 6 months of screening

The above is a clinical trial exclusion criterion. Annotated with entity spans:
Use of [Drug: depo medroxyprogesterone] [Temporal: within 6 months of screening]